Clinical trial inclusion criterion:
Hb A1c 7.0-10.0%

Entity relations:
- Has_value("Hb A1c", "7.0-10.0%")